最常見的原發性肺臟腫瘤是：
A. 支氣管原性癌
B. 過誤腫
C. 類癌瘤
D. 肉瘤

正確答案：A. 支氣管原性癌